Endometriosis

The above is a clinical trial exclusion criterion. Annotated with entity spans:
[Condition: Endometriosis]